Clinical trial inclusion criterion:
Age 18 to 65 years

Entity relations:
- Has_value("Age", "18 to 65 years")